有關中樞神經系統星狀膠原細胞（astrocyte）對損傷之反應，下列何者正確？
A. 膠樣變性（gliosis）只有星狀膠原細胞的增生（hyperplasia）而無肥大（hypertrophy）
B. 阿滋海默第二型（Alzheimer type Ⅱ）星狀膠原細胞主要見於阿滋海默病（Alzheimer disease）
C. 羅森賽氏纖維（Rosenthal fibers）常見於毛狀細胞星細胞瘤（pilocytic astrocytoma）
D. 澱粉小體（corpora amylacea）在不同年齡病人所見到的機率大致相同

正確答案：C. 羅森賽氏纖維（Rosenthal fibers）常見於毛狀細胞星細胞瘤（pilocytic astrocytoma）